Clinical trial inclusion criterion:
Age ≥ 18 years.

Annotated entities:
- Person: "Age"
- Value: "≥ 18 years"